在決定採取眼瞼下垂手術的方法時，下列那一個因素最重要？
A. 性別
B. 年齡
C. 單側或雙側眼瞼下垂
D. 上眼瞼提肌之功能

正確答案：D. 上眼瞼提肌之功能